Clinical trial inclusion criterion:
Current HAMD-17 score = 20 and the duration of the index episode is greater than or equal to four weeks.

Annotated entities:
- Measurement: "HAMD-17"
- Temporal: "Current"
- Value: "score = 20"
- Condition: "index episode"
- Temporal: "greater than or equal to four weeks"